Activa    el   sistema   renina-angiotensinaaldosterona un aumento de la:
1. Presión arterial.
2. Actividad parasimpática.
3. Concentración de Ca2+ en plasma.
4. Concentración de Na+ en plasma.
5. Actividad simpática.

Respuesta correcta: 5. Actividad simpática.